Clinical trial exclusion criterion:
Patients with leg injury involving nerve damage

Entity relations:
- AND("leg injury", "nerve damage")